failure to gain consent of parents.

The above is a clinical trial exclusion criterion. Annotated with entity spans:
[Informed_consent: failure to gain consent of parents].